Through which pathway does the FTO-guided demethylation of GADD46 drive myogenesis?

FTO-mediated demethylation of GADD45B promotes myogenesis through the activation of p38 MAPK pathway.